En el estadío de linfocito B inmaduro:
1. Aún no ha habido reordenamientos en la cadena ligera.
2. Se expresa IgM en superficie.
3. Se expresan sustitutos de la cadena ligera.
4. Hay diferenciación en respuesta a los antígenos.

Respuesta correcta: 2. Se expresa IgM en superficie.